Clinical trial exclusion criterion:
estimated glomerular filtration rate (eGFR) < 45 ml/min/1.73m2

Entity relations:
- Has_value("estimated glomerular filtration rate (eGFR)", "< 45 ml/min/1.73m2")